Clinical trial inclusion criterion:
Non-laboring

Annotated entities:
- Value: "Non-laboring"